Clinical trial inclusion criteria:
Women age 18-45
Within 6 months of expiration or beyond the end of the FDA-approved duration of use of the levonorgestrel intrauterine device (LNG-IUD = 5 years) OR the etonogestrel-releasing subdermal implant (ENG implant = 3 years)
Able to consent in English or Spanish.
Not pregnant at the time of enrollment

Annotated entities:
- Person: "Women"
- Person: "age"
- Value: "18-45"
- Non-representable: "Within 6 months of expiration or beyond the end of the FDA-approved duration of use of the levonorgestrel intrauterine device (LNG-IUD = 5 years) OR the etonogestrel-releasing subdermal implant (ENG implant = 3 years)"
- Informed_consent: "Able to consent in English or Spanish"
- Negation: "Not"
- Condition: "pregnant"
- Temporal: "at the time of enrollment"